Clinical trial exclusion criterion:
History of noncompliance with medical regimens, or patients who are considered to be potentially unreliable or unable to participate

Annotated entities:
- Post-eligibility: "History of noncompliance with medical regimens, or patients who are considered to be potentially unreliable or unable to participate"